Clinical trial inclusion criterion:
EDSS score 0.0 to 5.0 (inclusive) at Screening

Annotated entities:
- Measurement: "EDSS score"
- Value: "0.0 to 5.0"